Clinical trial exclusion criterion:
succinic semialdehyde dehydrogenase deficiency

Annotated entities:
- Condition: "succinic semialdehyde dehydrogenase deficiency"